Body mass index (BMI; weight [kilogram(kg)]/height^2 [meter square (m^2)]) between 18 and 30 kg/m^2, (inclusive)

The above is a clinical trial inclusion criterion. Annotated with entity spans:
[Measurement: Body mass index] ([Not_a_criteria: BMI; weight [kilogram(kg)]/height^2 [meter square (m^2)]]) [Value: between 18 and 30 kg/m^2], (inclusive)